Data from which major epigenome projects are contained in the DeepBlue epigenomic data server?

The DeepBlue Epigenomic Data Server contains data from four major epigenome projects, namely ENCODE, ROADMAP, BLUEPRINT and DEEP.